In which syndrome is the RPS19 gene most frequently mutated?

Diamond-Blackfan anemia (DBA) is a rare congenital red-cell aplasia characterized by anemia, bone-marrow erythroblastopenia, and congenital anomalies and is associated with heterozygous mutations in the ribosomal protein (RP) S19 gene (RPS19) in approximately 25% of probands. Mutations in the gene encoding ribosomal protein S19 (RPS19) have been identified in approximately 25% of DBA families.